Clinical trial inclusion criterion:
Aged < 1 or = 6 years and/or WBC = 20,000/µL

Annotated entities:
- Line: "Aged < 1 or = 6 years and/or WBC = 20,000/µL"
- Person: "Aged"
- Value: "< 1 or = 6 years"
- Measurement: "WBC"
- Value: "= 20,000/µL"